Clinical trial exclusion criterion:
Severe renal dysfunction, defined as:

Entity relations:
- Has_qualifier("renal dysfunction", "Severe")